Clinical trial exclusion criterion:
History of, or clinical evidence of, a condition which, in the opinion of the investigator, could confound the results of the study or put the subject at undue risk

Entity relations:
- AND("History", "could confound the results of the study or put the subject at undue risk a condition which")
- OR("History", "clinical evidence")